Admitted for labor management & develops a fever of 100.4 F or greater

The above is a clinical trial inclusion criterion. Annotated with entity spans:
[Mood: Admitted for] [Procedure: labor management] & develops a [Measurement: fever] of [Value: 100.4 F or greater]